某 58 歲男性，已有 30 年飲酒史，40 歲失業後每天飲高粱酒至少一瓶，且合併有酒精性肝炎，自 55 歲起逐漸出現記憶力退化，經醫師確診為酒精引起之失智症（alcohol-induced persisting dementia），
 則下列敘述何者正確？
A. 個案可能會出現虛談（confabulation）現象
B. 不須考量營養不良所引起之記憶力下降
C. 以長程記憶力缺損為主
D. 經適當治療通常 80%個案可以恢復記憶

正確答案：A. 個案可能會出現虛談（confabulation）現象